Clinical trial exclusion criterion:
Spontaneous labor (latent or active phase)

Entity relations:
- Has_qualifier("Spontaneous labor", "latent phase")
- OR("latent phase", "active phase")